Clinical trial inclusion criterion:
18-85 years of age, inclusive;

Annotated entities:
- Value: "18-85 years , inclusive"
- Person: "age"